HbA1c = 6,5 % or fasting glycemia =7mmol/l or non-fasting glycemia =11mmol/l

The above is a clinical trial inclusion criterion. Annotated with entity spans:
[Measurement: HbA1c] [Value: = 6,5 %] or [Measurement: fasting glycemia] [Value: =7mmol/l] or [Measurement: non-fasting glycemia] [Value: =11mmol/l]